張先生目前 38 歲，自從 25 歲開始被診斷為精神分裂病，過去曾經有二次住院的紀錄，目前也都一直在精神科門診接受追蹤治療。最近似乎沒有明顯的精神病症狀，也無明顯的幻覺或妄想症狀；但是外觀與行為觀察發現，他的衛生習慣相當不好，經常都不洗澡，也不修邊幅，凡事都提不起勁顯得相當懶散，生活型態日夜顛倒，幾乎完全沒有人際互動。父母與家人對他的問題顯得非常苦惱，更經常批評指責他的行為，所以常發生爭執造成不愉快。早上父母親因為他睡不起床，試圖把他叫醒，進而與他發生衝突，因而導致張先生出現情緒激動，有破壞物品以及暴力的行為出現，家人將他送到急診要求緊急的處理。則以下處理何者不被推薦？
A. 立刻給予深度的動力心理分析治療
B. 給予個案以及家屬精神衛生教育
C. 建議個案參加社區復健治療
D. 適度調整抗精神藥物的劑量

正確答案：A. 立刻給予深度的動力心理分析治療